Which are the clinical symptoms of left ventricular noncompaction?

The clinical symptoms of left ventricular noncompaction are:
1) heart failure, 
2) systemic thromboembolic events, 
3) ventricular arrhythmias and
4) sudden cardiac death.